Clinical trial exclusion criterion:
Psychological and / or cognitive impairments that restrict them to respond to questionnaires;

Annotated entities:
- Condition: "cognitive impairments"
- Qualifier: "restrict them to respond to questionnaires"
- Condition: "Psychological impairments"